一位 25 歲男性，3 個月前與家人在外野餐時，突發性地出現極度害怕之感覺、坐立不安、心跳快速且大力、呼吸急促、胸痛、喉嚨異物感、強烈害怕死亡與害怕失控感，以上之不適持續 15 分鐘後隨即消失，而後這樣子無預期之發作 1 週約 2-3 次，於戶外或家中皆曾發生，以致對於個案之生活與工作造成極大的影響。關於此個案之描述與處理，何者錯誤？
A. 過度飲用咖啡或吸入尼古丁會惡化症狀
B. 個案出現之陣發性發作是典型恐懼症（phobia）的表現
C. 診斷檢查需評估個案的甲狀腺功能和精神物質相關的疾病
D. 對於個案的胸痛，也要謹慎的評估其心臟病之危險因子與做心臟的相關檢查

正確答案：B. 個案出現之陣發性發作是典型恐懼症（phobia）的表現